Clinical trial exclusion criterion:
The participant has severe dyskinesia.

Entity relations:
- Has_qualifier("dyskinesia", "severe")